Clinical trial inclusion criterion:
Chronic HCV Infection of Genotype 1, 4, 5, or 6

Entity relations:
- Has_qualifier("Chronic HCV Infection", "Genotype 1")
- OR("Genotype 1", "Genotype 5", "Genotype 4", "Genotype 6")